Clinical trial exclusion criterion:
Emergent surgery

Annotated entities:
- Procedure: "Emergent surgery"